對於左心室收縮性功能異常的心臟衰竭病人，下列何種治療無法延長病人壽命？
A. 血管張力素轉化酶抑制劑（ACE inhibitors）
B. 乙型交感神經接受器阻斷劑（beta-adrenergic receptor blockers）
C. 毛地黃（digitalis）
D. 血管擴張劑組合（combination of vasodilators）

正確答案：C. 毛地黃（digitalis）